between 7 to 70 years of age

The above is a clinical trial inclusion criterion. Annotated with entity spans:
[Value: between 7 to 70 years] of [Person: age]